As of September 2018, what machine learning algorithm is used to for cardiac arrhythmia detection from a  short single-lead ECG recorded by a wearable device?

Support Vector machines( SVM) can be used for cardiac arrhythmia detection in from an ECG recorded by a wearable device.